Myelodysplastic syndrome or hematological malignancy

The above is a clinical trial exclusion criterion. Annotated with entity spans:
[Condition: Myelodysplastic syndrome] or [Condition: hematological malignancy]